Active implantable medical device (i.e. DBS, spinal cord stimulator, pacemaker, defibrillator, vagus nerve stimulator, programmable shunt).

The above is a clinical trial exclusion criterion. Annotated with entity spans:
[Qualifier: Active] [Device: implantable medical device] (i.e. [Device: DBS], [Device: spinal cord stimulator], [Device: pacemaker], [Device: defibrillator], [Device: vagus nerve stimulator], [Device: programmable shunt]).